Intranasal steroid use within the last three months

The above is a clinical trial exclusion criterion. Annotated with entity spans:
[Procedure: Intranasal steroid use] [Temporal: within the last three months]